Clinical trial inclusion criterion:
The presence of cycles until the age of 40 years with proven fertility, at least one child

Annotated entities:
- Condition: "presence of cycles"
- Value: "until the age of 40 years"
- Person: "age"
- Pregnancy_considerations: "The presence of cycles until the age of 40 years with proven fertility, at least one child"